Clinical trial exclusion criterion:
Allergic to contrast substance or radioisotope drugs used in procedures to assess endpoints of the study, which according to researchers, may be a contraindication to the implementation of these research methods.

Annotated entities:
- Condition: "Allergic"
- Drug: "contrast substance"
- Drug: "radioisotope drugs"